Clinical trial exclusion criterion:
3. Previous episode of S. aureus bacteremia within 3 months.

Annotated entities:
- Condition: "S. aureus bacteremia"
- Observation: "S. aureus"
- Qualifier: "S. aureus"
- Temporal: "within 3 months"